Clinical trial inclusion criterion:
Chronic pancreatitis requiring pancreatoduodenectomy

Entity relations:
- AND("requiring", "pancreatoduodenectomy")
- Has_context("Chronic pancreatitis", "requiring")